Clinical trial exclusion criterion:
Patients with combined HCV/HBV co-infection

Entity relations:
- OR("HCV infection", "HBV infection")